下列何者最有可能引起白內障（cataract）、心臟缺陷及耳聾等先天性異常現象？
A. 德國麻疹病毒（rubella virus）
B. 巨細胞病毒（cytomegalovirus）
C. 弓漿蟲（Taxoplasma gondii）
D. 梅毒螺旋體（Treponema phallidum）

正確答案：A. 德國麻疹病毒（rubella virus）